inability to cooperate with protocol requirements

The above is a clinical trial inclusion criterion. Annotated with entity spans:
[Non-query-able: inability to cooperate with protocol requirements]